下列有關恙蟲病（scrub typhus）之敘述，何者錯誤？
A. 病原菌為Orientia tsutsugamushi
B. 傳播媒介是鳥
C. 潛伏期為6～21天
D. 最佳治療藥物是Tetracycline類藥物

正確答案：B. 傳播媒介是鳥